¿Cuáles son los componentes de un grupo hemo funcional?:
1. Cuatro moléculas de bilirrubina y un Fe3+.
2. Cuatro globinas (2alfa+2beta) y un Fe3+.
3. Una molécula de protoporfirina y un Fe2+.
4. Una molécula de bilirrubina y un Fe2+.
5. Cuatro globinas (2alfa+2beta) y un Fe2+.

Respuesta correcta: 3. Una molécula de protoporfirina y un Fe2+.